Diagnosis of idiopathic Parkinson's disease that is optimally treated (motor fluctuations <20% of subject's awake time). Subjects may be on levodopa therapy but must be stable at the time of entry into the study

The above is a clinical trial inclusion criterion. Annotated with entity spans:
Diagnosis of [Condition: idiopathic Parkinson's disease] that is optimally [Qualifier: treated] ([Measurement: motor fluctuations] [Value: <20% of subject's awake time]). Subjects may be on levodopa therapy but must be stable at the time of entry into the study